Clinical trial exclusion criterion:
Use of antidiabetic drugs other than metformin within 3 months prior to screening.

Annotated entities:
- Drug: "antidiabetic drugs"
- Drug: "metformin"
- Negation: "other than"
- Temporal: "within 3 months prior to screening"